一位 39 歲女性，主訴近 1 個月超過 4 次以上身體不適，每次發作均為無預警，無固定時段，發作期間約為 10 分鐘時症狀達到巔峰，合併有心悸、冒汗、手抖、腹脹、頭暈，感覺瀕臨崩潰、死亡，及近乎發狂。下列何者為其最可能之臨床診斷？
A. 廣泛性焦慮症
B. 恐慌症
C. 創傷後壓力症候群
D. 強迫症

正確答案：B. 恐慌症